Iloprost cure carried out in the previous month or planned in the following month.

The above is a clinical trial exclusion criterion. Annotated with entity spans:
[Drug: Iloprost] cure carried out [Temporal: in the previous month] or [Non-query-able: planned in the following month].